在哺乳類細胞中，N5-甲基四氫葉酸（N5-methyl tetrahydrofolate；N5-methyl H4 folate）直接參與下列那一種胺基酸的生合成？
A. isoleucine
B. leucine
C. lysine
D. methionine

正確答案：D. methionine